1. Present for at least 4 weeks

The above is a clinical trial inclusion criterion. Annotated with entity spans:
[Parsing_Error: 1.] [Qualifier: Present] for [Temporal: at least 4 weeks]